Clinical trial exclusion criterion:
chronic kidney disease stage IV and V

Entity relations:
- Has_qualifier("chronic kidney disease", "stage IV")
- OR("stage IV", "stage V")